Subject motivated to seek treatment for erectile dysfunction.

The above is a clinical trial inclusion criterion. Annotated with entity spans:
[Post-eligibility: Subject motivated to seek treatment for erectile dysfunction].